En el análisis de arsénico por cámara de grafito se pueden producir pérdidas de dicho elemento por volatilización durante la etapa de carbonización. Este hecho puede minimizarse si :
1. Elevamos la temperatura durante la etapa de carbonización.
2. Incrementamos el tiempo de carbonización.
3. Adicionamos modificadores de matriz que estabilicen térmicamente el analito.
4. Bajamos la temperatura durante la etapa de carbonización.
5. Modificamos el programa de secado para vaporizar completamente el disolvente.

Respuesta correcta: 3. Adicionamos modificadores de matriz que estabilicen térmicamente el analito.